Clinical trial exclusion criterion:
use of any sedative hypnotics, tranquilizers, anticonvulsants, antihistamines (except non-sedating), benzodiazepines, clonidine or any medication known to affect dopamine at start of baseline period

Entity relations:
- Has_negation("non-sedating", "except")
- Has_qualifier("antihistamines", "non-sedating")
- Has_temporal("sedative hypnotics", "at start of baseline period")
- OR("sedative hypnotics", "medication known to affect dopamine", "benzodiazepines", "antihistamines", "anticonvulsants", "tranquilizers", "clonidine")